What happens to the expression levels of piRNAs in the case of intracranial aneurysm rupture?

piRNAs showed a substantial decrease in RNA abundance that was sustained after IA rupture.